臀上神經受到壓迫損傷，下列何者的功能最不受影響？
A. 臀大肌
B. 臀中肌
C. 臀小肌
D. 闊筋膜張肌

正確答案：A. 臀大肌